Medical contraindications to SSRI therapy as determined by history (including induction of mania or hypomania during SSRI therapy, or known drug allergy)

The above is a clinical trial exclusion criterion. Annotated with entity spans:
Medical [Condition: contraindications to SSRI therapy] as determined by [Temporal: history] (including induction of [Condition: mania] or [Condition: hypomania] [Temporal: during SSRI therapy], or known [Condition: drug allergy])